TPED > 135° (Tubiana stage 4) in finger to be treated

The above is a clinical trial exclusion criterion. Annotated with entity spans:
[Measurement: TPED] [Value: > 135°] ([Measurement: Tubiana] [Value: stage 4]) in [Qualifier: finger to be treated]